Clinical trial exclusion criterion:
Fever, elevated white cell count, or other evidence of active infection

Entity relations:
- Has_value("white cell count", "elevated")
- Has_mood("active infection", "evidence")
- OR("Fever", "white cell count", "active infection")